乳癌手術後，手臂內側感覺麻木乃因下列何種神經受到傷害？
A. 胸背神經（thoracodorsal nerve）
B. 肋間肱神經（intercostobrachial nerve）
C. 長胸神經（long thoracic nerve）
D. 肋間神經（intercostal nerve）

正確答案：B. 肋間肱神經（intercostobrachial nerve）